Clinical trial inclusion criterion:
Normal cognitive function in order to sign written, informed consent and to understand trial protocol

Annotated entities:
- Value: "Normal"
- Measurement: "cognitive function"